Classification of the American Society of Anesthesiologists (ASA I-III)

The above is a clinical trial inclusion criterion. Annotated with entity spans:
[Measurement: Classification of the American Society of Anesthesiologists] ([Measurement: ASA] [Value: I-III])